Clinical trial exclusion criterion:
Subject with an abnormal karyotype in favor of Turner syndrome or having a premutation of the FMR1 gene or a syndromic form

Annotated entities:
- Condition: "abnormal karyotype"
- Condition: "Turner syndrome"
- Condition: "premutation of the FMR1 gene"
- Condition: "syndromic form"
- Undefined_semantics: "syndromic form"